Clinical trial inclusion criteria:
A diagnosis of VTE in outpatient clinic or as discharge diagnosis after hospitalization.
A claimed prescription of a NOAC from a Danish pharmacy within 14 days of discharge or outpatient clinic visit.

Annotated entities:
- Condition: "VTE"
- Visit: "outpatient clinic"
- Qualifier: "discharge diagnosis"
- Temporal: "after hospitalization"
- Reference_point: "hospitalization"
- Procedure: "hospitalization"
- Procedure: "prescription"
- Drug: "NOAC"
- Qualifier: "Danish pharmacy"
- Temporal: "within 14 days of discharge or outpatient clinic visit"
- Reference_point: "discharge or outpatient clinic visit"
- Procedure: "discharge"
- Procedure: "outpatient clinic visit"
- Visit: "outpatient clinic"
- Qualifier: "claimed"